Clinical trial exclusion criterion:
Child-Pugh grade B/C liver failure

Annotated entities:
- Measurement: "Child-Pugh grade"
- Value: "B"
- Value: "C"
- Condition: "liver failure"